中樞神經系統內，具有吞噬能力的細胞是：
A. 原生質性星狀膠細胞（protoplasmic astrocyte）
B. 纖維性星狀膠細胞（fibrous astrocyte）
C. 寡突膠細胞（oligodendrocyte）
D. 微膠細胞（microglia）

正確答案：D. 微膠細胞（microglia）